pregnant or lactating (only excluded from imaging study)

The above is a clinical trial exclusion criterion. Annotated with entity spans:
[Pregnancy_considerations: pregnant or lactating (only excluded from imaging study)]